Known. acyanotic congenital heart disease or children after cardiac interventional procedures for follow-up examination.

The above is a clinical trial exclusion criterion. Annotated with entity spans:
Known. [Condition: acyanotic congenital heart disease] or [Person: children] [Temporal: after cardiac interventional procedures] [Qualifier: for follow-up examination].